Clinical trial exclusion criterion:
4. AML in relapse or refractory after 3 or more previous lines of chemotherapy (and/or HSCT) treatment

Entity relations:
- Has_temporal("lines of chemotherapy", "previous")
- Has_multiplier("lines of chemotherapy", "3 or more")
- multi("after 3 or more previous lines of chemotherapy", "lines of chemotherapy")
- Has_temporal("in relapse", "after 3 or more previous lines of chemotherapy")
- Has_qualifier("AML", "in relapse")
- OR("in relapse", "refractory")